Which histone mark is recognized by HP1?

Methylation of histone H3 lysine 9 creates a binding site for HP1 proteins.  Here we show that mammalian methyltransferases that selectively methylate histone H3 on lysine 9 (Suv39h HMTases) generate a binding site for HP1 proteins--a family of heterochromatic adaptor molecules implicated in both gene silencing and supra-nucleosomal chromatin structure.